Clinical trial exclusion criterion:
Allergy to any drugs

Entity relations:
- AND("Allergy", "any drugs")